一位25歲男性，摩托車騎士，因酒後不慎撞上安全島，顏面挫傷送至急診時，病人抱怨眼眶周圍疼痛、眼瞼有瘀血且浮腫。下列有關Blowout fracture的敘述，何者錯誤？
A. Waters' view及Caldwell view檢查可助於評估眼底骨折
B. frontal sinus比maxillary sinus更容易積血
C. Blowout fracture主要因orbital floor太薄弱導致
D. 常伴隨有複視現象（diplopia）

正確答案：B. frontal sinus比maxillary sinus更容易積血